Clinical trial exclusion criterion:
Contraindicated to either diuretics or BCAA

Entity relations:
- AND("Contraindicated", "diuretics")
- OR("diuretics", "BCAA")